Clinical trial exclusion criterion:
Women under the age of 18,

Annotated entities:
- Person: "Women"
- Person: "age"
- Value: "18 under"